披衣菌（Chlamydia )以下列何種形態在宿主細胞間傳染？
A. 微孢子（microspore）
B. 基體（elementary body）
C. 網狀體（reticulate body）
D. 包涵體（inclusion body）

正確答案：B. 基體（elementary body）